Clinical trial exclusion criterion:
Known allergy or hypersensitivity to escitalopram or bupropion

Annotated entities:
- Condition: "allergy"
- Condition: "hypersensitivity"
- Drug: "escitalopram"
- Drug: "bupropion"